精神分裂症患者最常出現之幻覺（hallucination）為下列那一種？
A. 視幻覺
B. 嗅幻覺
C. 聽幻覺
D. 觸幻覺

正確答案：C. 聽幻覺